The score of HAMD =21

The above is a clinical trial exclusion criterion. Annotated with entity spans:
The [Measurement: score of HAMD] [Value: =21]